子宮鏡手術可能產生的併發症的敘述，下列何者錯誤？
A. 術前須建立測血液中的電解質當作基準
B. 最好每5分鐘計算灌入液與流出液的差別
C. 灌入與流出差異未達兩公升以上，無須給與利尿劑
D. 灌注壓力70～80 mmHg是適合的

正確答案：C. 灌入與流出差異未達兩公升以上，無須給與利尿劑